Clinical trial exclusion criterion:
Intolerance of pulsed corticosteroids, especially a history of steroid psychosis

Annotated entities:
- Drug: "pulsed corticosteroids"
- Temporal: "history of"
- Condition: "steroid psychosis"
- Condition: "Intolerance"